have a residual limb length which does not allow for seven inches clearance of bracket attachment for the PowerFoot

The above is a clinical trial exclusion criterion. Annotated with entity spans:
have a [Measurement: residual limb length] which [Value: does not allow for seven inches clearance of bracket attachment] for the PowerFoot